Clinical trial exclusion criterion:
substance misuse other contraindication to used study drugs no informed consent

Entity relations:
- AND("contraindication", "study drugs")
- OR("substance misuse", "contraindication")